Clinical trial exclusion criterion:
Bleeding from gastric varices, with or without esophageal varices

Annotated entities:
- Condition: "Bleeding"
- Condition: "gastric varices"
- Condition: "esophageal varices"